Clinical trial exclusion criterion:
History of allergic reaction to abciximab or eptifibatide or any component used in the study (including contrast media)

Entity relations:
- Subsumes("component used in the study", "contrast media")
- AND("History", "allergic reaction")
- AND("allergic reaction", "abciximab")
- OR("abciximab", "eptifibatide", "component used in the study", "contrast media")